下列有關睪丸精母細胞瘤（testicular seminoma）的敘述， 何者較不正確？
A. 常見的染色體變化為第十二條染色體短臂的等臂染色體（isochromosome 12p）
B. 腫瘤細胞會表現OCT3/4與NANOG
C. 常常發生在嬰兒時期（infant）
D. 部分腫瘤會有KIT gene的活化性突變（activating mutations）

正確答案：C. 常常發生在嬰兒時期（infant）